Patients with clinically significant ECG or laboratory abnormalities

The above is a clinical trial exclusion criterion. Annotated with entity spans:
Patients with [Qualifier: clinically significant] [Condition: ECG] or [Condition: laboratory abnormalities]